思覺失調症（schizophrenia）患者的症狀可分為正性症狀（positive symptoms）與負性症狀（negative symptoms），下列何者是負性症狀？
A. 妄想（delusions）
B. 幻覺（hallucinations）
C. 貧語（alogia）
D. 混亂語言（disorganized speech）

正確答案：C. 貧語（alogia）